Clinical trial exclusion criterion:
Patients who are curable by conventional multidisciplinary management.

Annotated entities:
- Procedure: "conventional multidisciplinary management"
- Qualifier: "curable"
- Context_Error: "curable"